Mujer de 70 años con antecedente de anorexia, pérdida de peso, molestias en la musculatura y articulaciones proximales más dolorimiento en la región temporo-mandibular que acude al servicio de urgencias por pérdida de visión unilateral (movimiento de manos), de aparición brusca e indolora (defecto pupilar aferente). ¿Qué prueba solicitaría en primer lugar con fines diagnósticos?
1. Punción lumbar.
2. Proteína C Reactiva.
3. Angio Resonancia Magnética.
4. Ecografía carotídea.

Respuesta correcta: 2. Proteína C Reactiva.